下列有關 metoclopramide 之敘述，何者錯誤？
A. 可減少小腸 ACh 之釋放
B. 屬於 dopamine D2受體拮抗劑及 5-HT4 agonist
C. 可以作用於中樞神經之 chemoreceptor trigger zone（CTZ）
D. 有 dystonia 副作用

正確答案：A. 可減少小腸 ACh 之釋放